Clinical trial inclusion criterion:
Age of 18 and over, male or female;

Entity relations:
- Has_value("Age", "18 and over")
- OR("male", "female")